Clinical trial exclusion criterion:
Biliary strictures caused by confirmed benign tumors

Entity relations:
- Has_qualifier("benign tumors", "confirmed")
- AND("Biliary strictures", "benign tumors")